Clinical trial exclusion criterion:
Other tumor type than adenocarcinoma

Annotated entities:
- Condition: "adenocarcinoma"
- Condition: "tumor"
- Negation: "Other"